Which are the thyroid hormone analogs utilized in human studies?

TRIAC and TETRAC are two different thyroid hormone analogs utilized in human studies